1. Left main disease (angiographically> 50%)

The above is a clinical trial exclusion criterion. Annotated with entity spans:
[Parsing_Error: 1.] [Condition: Left main disease] [Context_Error: (angiographically> 50%)]